下列那些軟骨組織可進行附加性生長（appositional growth）？①透明軟骨（hyaline cartilage） ②彈性軟骨（elastic cartilage） ③纖維軟骨（fibrocartilage）
A. ①②
B. ①③
C. ②③
D. ①②③

正確答案：A. ①②